原發性自發性氣胸（primary spontaneous pneumothorax）的敘述，下列何者最不恰當？
A. 大都是因為肋膜氣泡（pleural blebs）破裂
B. 約有一半（50％）病患會再次發生氣胸
C. 初次治療可考量簡單抽吸（simple aspiration）
D. 胸腔鏡所做肋膜黏連（thoracoscopy with pleural abrasion）氣胸再發生率約25%

正確答案：D. 胸腔鏡所做肋膜黏連（thoracoscopy with pleural abrasion）氣胸再發生率約25%